Which disorder is caused by biallelic mutations in G-Protein coupled receptor kinase 1 (GRK1)?

Biallelic mutations in G-Protein coupled receptor kinase 1 (GRK1) cause Oguchi disease, a rare subtype of congenital stationary night blindness (CSNB).